Clinical trial exclusion criterion:
24. HIV-positive

Entity relations:
- Has_value("HIV", "positive")